Clinical trial inclusion criterion:
Non-pregnant, non-lactating female patients, whose screening pregnancy test is negative and who are using contraceptive methods deemed reliable by the investigator, or who are at least 2 years post-menopausal or surgically sterilized.

Annotated entities:
- Condition: "pregnant"
- Negation: "Non"
- Condition: "lactating"
- Negation: "non"
- Person: "female"
- Measurement: "pregnancy test"
- Value: "negative"
- Device: "contraceptive methods"
- Subjective_judgement: "deemed reliable by the investigator"
- Temporal: "at least 2 years"
- Condition: "post-menopausal"
- Condition: "surgically sterilized"
- Procedure: "surgically"
- Qualifier: "deemed reliable by the investigator"